La tensión superficial:
1. Se define únicamente para interfases planas.
2. Si tiene un valor alto para una sustancia la obligará a ascender por un capilar, si éste se introduce en su interior.
3. Existe porque las interfases líquido-vapor tienden espontáneamente a aumentar su tamaño.
4. Es la constante de proporcionalidad que relaciona el trabajo necesario para aumentar el tamaño de una interfase líquido-vapor con el aumento del área de dicha interfase.

Respuesta correcta: 4. Es la constante de proporcionalidad que relaciona el trabajo necesario para aumentar el tamaño de una interfase líquido-vapor con el aumento del área de dicha interfase.